有關顳頜關節（temporomandibular joint）之敘述，下列何者正確？
A. 莖突下頜韌帶（stylomandibular ligament）附	在下頜骨的舌部（lingula of mandible）
B. 蝶骨下頜韌帶（sphenomandibular ligament）附	在下頜角（angle of mandible）
C. 翼外肌（lateral pterygoid muscle）收縮造成下頜骨的前引（protrusion）
D. 顳頜關節的關節盤是由彈性軟骨（elastic cartilage）構成

正確答案：C. 翼外肌（lateral pterygoid muscle）收縮造成下頜骨的前引（protrusion）